下列物質在胃部的壁細胞（Parietal cells）有受體，可以調節胃酸之分泌，但是何者例外？
A. Acetylcholine
B. Histamine
C. Prostaglandin
D. Secretin

正確答案：D. Secretin